下列那一種致病原會在巨噬細胞（macrophage）內增殖，並在肝臟形成散在性小型壞死結節？
A. Campylobacter enterocolitis
B. Entamoeba histolytica
C. Salmonella typhi
D. Clonorchis sinensis

正確答案：C. Salmonella typhi